Cuando se inyecta 1 nanolitro (nL) de muestra nos estamos refiriendo a la inyección de:
1. 10-1 L.
2. 10-3 L.
3. 10-6 L.
4. 10-9 L.
5. 10-12 L.

Respuesta correcta: 4. 10-9 L.